Clinical trial exclusion criterion:
contraindicate to ketamine

Entity relations:
- AND("contraindicate", "ketamine")